3. Designated venous leg ulcer meets the following criteria at both the screening and baseline visits. If the patient has multiple ulcers, at least one ulcer must meet the following criteria at both the screening and baseline visits:

The above is a clinical trial inclusion criterion. Annotated with entity spans:
[Parsing_Error: 3.] [Parsing_Error: Designated venous leg ulcer meets the following criteria at both the screening and baseline visits.] [Parsing_Error: If the patient has multiple ulcers, at least one ulcer must meet the following criteria at both the screening and baseline visits:]